Chemotherapy and radiotherapy

The above is a clinical trial exclusion criterion. Annotated with entity spans:
[Procedure: Chemotherapy] and [Procedure: radiotherapy]